深腹股溝環（deep inguinal ring）開口於下列何者？
A. 腹外斜肌腱膜（aponeurosis）
B. 腹橫肌膜（fascia transversalis）
C. 腹內斜肌
D. 腹橫肌

正確答案：B. 腹橫肌膜（fascia transversalis）